¿Cómo se llaman los genes de diferentes especies que tienen una clara relación de secuencia y función?
1. Ortólogos.
2. Homólogos.
3. Parálogos.
4. Heterólogos.

Respuesta correcta: 1. Ortólogos.